St. John's Wort

The above is a clinical trial exclusion criterion. Annotated with entity spans:
[Drug: St. John's Wort]